Clinical trial exclusion criterion:
Artificial heart valves requiring treatment with an anticoagulant

Annotated entities:
- Device: "Artificial heart valves"
- Drug: "anticoagulant"